Clinical trial exclusion criterion:
patients in therapy with anticoagulants or antiaggregants;

Entity relations:
- AND("therapy", "anticoagulants")
- OR("anticoagulants", "antiaggregants")